有關添加副食品的做法，下列何者最不適切？
A. 蜂蜜水可以給 1 歲以下之嬰兒補充水分及熱量
B. 嬰兒 4 至 6 個月時可添加副食品
C. 每次以只添加一種副食品為原則
D. 米粉或麥粉可以開水或嬰兒配方奶調成糊狀，用茶匙餵食

正確答案：A. 蜂蜜水可以給 1 歲以下之嬰兒補充水分及熱量